List second messengers.

Cyclic adenosine monophosphate
Ceramide
Cyclic diguanylate
Nitric oxide
Calcium
Diacylglycerol